Clinical trial inclusion criteria:
Patient has been fully informed and has signed an IRB approved informed consent form within 7 days (Day 7-13) prior to POD 15 and is willing and able to follow study procedure
Patient is a primary liver transplant recipient
Patient is 20 to 70 years of age
Patient should be clearly conscious, fully understand and able to answer questionnaire

Annotated entities:
- Post-eligibility: "Patient has been fully informed and has signed an IRB approved informed consent form within 7 days (Day 7-13) prior to POD 15 and is willing and able to follow study procedure"
- Condition: "primary liver transplant"
- Person: "recipient"
- Person: "age"
- Value: "20 to 70 years"
- Post-eligibility: "Patient should be clearly conscious, fully understand and able to answer questionnaire"